Abnormal renal function as evidenced by a calculated creatinine clearance < 30 ml/minute.

The above is a clinical trial exclusion criterion. Annotated with entity spans:
[Value: Abnormal] [Measurement: renal function] as evidenced by a [Measurement: calculated creatinine clearance] [Value: < 30 ml/minute].